Clinical trial exclusion criterion:
Documented allergy to local anesthetic

Entity relations:
- AND("allergy", "local anesthetic")